Female

The above is a clinical trial inclusion criterion. Annotated with entity spans:
[Person: Female]